Amiodarone. Subjects previously treated with amiodarone must have stopped the amiodarone at least 60 days prior to day 1 of SOF/LDV FDC

The above is a clinical trial exclusion criterion. Annotated with entity spans:
[Drug: Amiodarone]. [Non-query-able: Subjects previously treated with amiodarone must have stopped the amiodarone] [Temporal: at least 60 days prior to day 1 of SOF/LDV FDC]